Clinical trial exclusion criterion:
Known history of/suspected malignant neoplasm of various sites.

Annotated entities:
- Temporal: "history of"
- Mood: "suspected"
- Condition: "malignant neoplasm"
- Qualifier: "various sites"